Clinical trial inclusion criterion:
concomitant medical illness that in the opinion of the investigator is associated with a life expectancy < 1 year

Entity relations:
- Has_qualifier("concomitant medical illness", "is associated with a life expectancy < 1 year")